Participants and their families not planning to move away from the area for the duration of the study

The above is a clinical trial inclusion criterion. Annotated with entity spans:
Participants and their families [Negation: not] [Mood: planning to move away] from the area [Temporal: for the duration of the study]